Clinical trial inclusion criterion:
Patients who are on Tacrolimus immunosuppressive therapy twice a day for at least two weeks.

Entity relations:
- Has_multiplier("Tacrolimus", "twice a day")
- Has_temporal("Tacrolimus", "at least two weeks")